Clinical trial exclusion criterion:
History of fainting or other significant adverse reaction during phlebotomy or donation of blood

Annotated entities:
- Condition: "fainting"
- Procedure: "phlebotomy"
- Condition: "adverse reaction"
- Observation: "donation of blood"